Clinical trial inclusion criteria:
Likely suffer moderate-to-severe OSA based on history and physical or have an established diagnosis of OSA (20=AHI=65) based on a prior in-lab Polysomnography
Documentation the subject not effectively treated with CPAP therapy. (Examples include non-compliance, discomfort, undesirable side effects, symptoms persist despite use). Subjects who have been prescribed, but refuse to try CPAP would be considered intolerant.
Age 22 or above
Willing and capable to have stimulation hardware permanently implanted, and to use the patient remote to activate the stimulation
Willing and capable to return for all follow-up visits and conduct sleep studies at home, including the evaluation procedures and filling out questionnaires
Willing and capable of providing informed consent

Annotated entities:
- Condition: "OSA"
- Qualifier: "moderate"
- Qualifier: "severe"
- Condition: "OSA"
- Measurement: "AHI"
- Value: "20 =65"
- Negation: "not"
- Procedure: "CPAP therapy"
- Person: "Age"
- Value: "22 or above"
- Post-eligibility: "Willing and capable to have stimulation hardware permanently implanted, and to use the patient remote to activate the stimulation"
- Post-eligibility: "Willing and capable to return for all follow-up visits and conduct sleep studies at home, including the evaluation procedures and filling out questionnaires"
- Informed_consent: "Willing and capable of providing informed consent"